Nodal involvement

The above is a clinical trial inclusion criterion. Annotated with entity spans:
[Condition: Nodal involvement]